Clinical trial inclusion criterion:
either loco-regional or lymph node metastasis

Annotated entities:
- Condition: "loco-regional metastasis"
- Condition: "lymph node metastasis"